¿Cuál de los siguientes trastornos presenta una mayor comorbilidad con el Trastorno Obsesivo Compulsivo en adultos?:
1. Depresión.
2. Trastornos de la Conducta Alimentaria.
3. Trastornos de Control de Impulsos.
4. Trastornos de la Personalidad.

Respuesta correcta: 1. Depresión.